Diastolic blood pressure 60-90 mmHg

The above is a clinical trial inclusion criterion. Annotated with entity spans:
[Measurement: Diastolic blood pressure] [Value: 60-90 mmHg]